Controls (without a history of TBI):

The above is a clinical trial exclusion criterion. Annotated with entity spans:
[Parsing_Error: Controls (without a history of TBI):]